Clinical trial exclusion criteria:
Drug-induced hypotension, if necessary, evaluate patient after discontinuing the causative drug for one month
Heart failure or Chronic renal failure
Severe supine hypertension (Systolic Blood Pressure >180 or Diastolic Blood Pressure>110mmHg)
Pregnant women, breast-feeding
Unable to perform questionnaire

Annotated entities:
- Qualifier: "Drug-induced"
- Condition: "hypotension"
- Non-representable: "if necessary, evaluate patient after discontinuing the causative drug for one month"
- Condition: "Heart failure"
- Condition: "Chronic renal failure"
- Condition: "supine hypertension"
- Qualifier: "Severe"
- Measurement: "Systolic Blood Pressure"
- Measurement: "Diastolic Blood Pressure"
- Value: ">180"
- Value: ">110mmHg"
- Condition: "Pregnant"
- Person: "women"
- Condition: "breast-feeding"
- Observation: "Unable to perform questionnaire"